人類雙股DNA在中性pH水溶液中，溫度由37℃加熱到95℃時，下列敘述何者錯誤？
A. UV 260 nm的吸光度增加
B. N-醣苷共價鍵（N-glycosidic bond）發生斷裂現象
C. 雙股螺旋結構解開（unwinds）
D. DNA不會由水溶液中沉澱出來

正確答案：B. N-醣苷共價鍵（N-glycosidic bond）發生斷裂現象